Clinical trial inclusion criterion:
PTSD related to physical or sexual assault

Annotated entities:
- Observation: "physical assault"
- Observation: "sexual assault"
- Condition: "PTSD"